Clinical trial exclusion criterion:
Concurrent terminal illness or other severe disease (e.g., active neoplasm) or other significant laboratory value(s) which, in the opinion of the investigator, could preclude participation or survival

Entity relations:
- Has_qualifier("severe disease", "other")
- Has_qualifier("neoplasm", "active")
- Subsumes("severe disease", "neoplasm")
- multi("significant laboratory value(s)", "laboratory")
- multi("laboratory", "laboratory")
- Has_temporal("terminal illness", "Concurrent")
- OR("terminal illness", "severe disease", "significant laboratory value(s)")